有關使用抗生素所引起之偽膜性腸炎（pseudomembranous colitis）的敘述，下列何者錯誤？
A. 常由艱難梭菌（Clostridium difficile）所引起
B. 非皆為外源性（exogenous）感染之疾病
C. 糞便移植（fecal transplantation）通常不具療效
D. 可以甲硝達唑（Metronidazole）或萬古黴素（Vancomycin）治療

正確答案：C. 糞便移植（fecal transplantation）通常不具療效